小兒肝臟惡性腫瘤常見的是肝母細胞瘤（hepatoblastoma）和肝細胞瘤（hepatocellular carcinoma），下列敘述何者正確？
A. 肝母細胞瘤（hepatoblastoma）好發在 5 歲以上年齡較大的小孩
B. 二者的腫瘤標記都是胎兒蛋白（α-fetoprotein, AFP）
C. 總體而言，肝細胞瘤（hepatocellular carcinoma）預後較肝母細胞瘤（hepatoblastoma）好
D. 肝細胞瘤（hepatocellular carcinoma）常合併 Beckwith-Wiedemann syndrome

正確答案：B. 二者的腫瘤標記都是胎兒蛋白（α-fetoprotein, AFP）